contraindications to brachial plexus block (e.g., allergy to local anaesthetics, malignancy or infection in the area);

The above is a clinical trial exclusion criterion. Annotated with entity spans:
[Condition: contraindications] to [Procedure: brachial plexus block] (e.g., [Condition: allergy] to [Drug: local anaesthetics], [Condition: malignancy] or [Condition: infection] [Qualifier: in the area]);